4. AML in relapse or refractory after 3 or more previous lines of chemotherapy (and/or HSCT) treatment

The above is a clinical trial exclusion criterion. Annotated with entity spans:
4. [Condition: AML] [Qualifier: in relapse] or [Qualifier: refractory] [Temporal: after 3 or more previous lines of chemotherapy] (and/or HSCT) treatment